多發性結節性動脈炎（Polyarteritis nodosa）的致病因，常和下列感染有關，惟何者例外？
A. Hepatitis B
B. Hepatitis C
C. Hepatitis A
D. Streptococcus

正確答案：C. Hepatitis A